全世界最常見之腎小球病變（glomerulopathy）為那一種？
A. 膜性腎炎（Membranous glomerulonephritis）
B. 免疫球蛋白 A 型腎病變（Immunoglobulin A nephropathy, Burger's disease）
C. 極微變化型腎病變（Minimal change disease）
D. 局變腎小球腎炎（Focal glomerulonephritis）

正確答案：B. 免疫球蛋白 A 型腎病變（Immunoglobulin A nephropathy, Burger's disease）